氣體交換（gas exchange）可發生在下列那些位置？①支氣管（bronchi） ②肺泡（alveoli） ③末端細支氣管（terminal bronchioles） ④呼吸性細支氣管（respiratory bronchioles）
A. 僅①②
B. 僅②④
C. 僅②③④
D. 僅①③④

正確答案：B. 僅②④